Hypersensitivity to the active substance or to any of the excipients or to E. coli derived proteins

The above is a clinical trial exclusion criterion. Annotated with entity spans:
[Condition: Hypersensitivity] [Non-query-able: to the active substance or to any of the excipients or to E. coli derived proteins]